Clinical trial inclusion criterion:
Single stroke having occurred more than 6 months before (previous TIA is accepted).

Entity relations:
- Has_multiplier("stroke", "Single")
- Has_temporal("stroke", "more than 6 months")
- Subsumes("stroke", "TIA")